下列關於intramedullary spinal cord tumor的敘述，何者錯誤？
A. intramedullary spinal cord tumor約占所有spinal tumor的5%
B. primary intramedullary spinal cord lymphoma相當罕見
C. 最常見的intramedullary spinal cord tumor為轉移性腫瘤
D. 黏液乳突狀室管膜瘤（myxopapillary ependymoma）較常長在腰椎處

正確答案：C. 最常見的intramedullary spinal cord tumor為轉移性腫瘤